Clinical trial exclusion criterion:
Known bigemini/trigeminy

Annotated entities:
- Condition: "bigemini"
- Condition: "trigeminy"